2. Suspected or known digestive tract obstruction, stricture, or perforation

The above is a clinical trial exclusion criterion. Annotated with entity spans:
[Parsing_Error: 2.] Suspected or known [Condition: digestive tract obstruction], stricture, or perforation